¿Qué especie del género Clostridium es productora de enterotoxina A y citotoxina B, responsables del cuadro diarreico (colitis seudomembranosa) asociado al tratamiento con antimicrobianos?:
1. Clostridium perfringens.
2. Clostridium difficile.
3. Clostridium botulinum.
4. Clostridium novyi.
5. Clostridium histolyticum.

Respuesta correcta: 2. Clostridium difficile.